Preoperative renal failure requiring dialysis

The above is a clinical trial exclusion criterion. Annotated with entity spans:
[Temporal: Preoperative] [Condition: renal failure] [Mood: requiring] [Procedure: dialysis]